Clinical trial inclusion criterion:
An ECOG PS score of between 0 and 1;

Entity relations:
- Has_value("ECOG PS", "between 0 and 1")